Clinical trial inclusion criterion:
American Society of Anesthesiology (ASA) Class I and II

Entity relations:
- Has_value("American Society of Anesthesiology (ASA) Class", "I and II")